一位懷孕 25 週婦女，經 100 公克口服葡萄糖耐性試驗後，得到以下血糖值：空腹 90 mg/dL，1 小時 mg/dL，2 小時 170 mg/dL，3 小時 160 mg/dL，下列何者為正確之診斷？
A. 正常
B. 妊娠糖尿病
C. 無法確認診斷，須再重複一次檢查
D. 葡萄糖耐性不良

正確答案：B. 妊娠糖尿病